Clinical trial inclusion criteria:
BV positive by Nugent score
HIV negative
Capable of providing written informed consent

Annotated entities:
- Measurement: "BV"
- Value: "positive"
- Measurement: "Nugent score"
- Measurement: "HIV"
- Value: "negative"
- Post-eligibility: "Capable of providing written informed consent"